Clinical trial exclusion criterion:
Drug or alcohol dependence, or abuse within the past 3 months, soy-bean oil allergy

Annotated entities:
- Condition: "Drug dependence"
- Condition: "alcohol dependence"
- Temporal: "within the past 3 months"
- Condition: "Drug abuse"
- Condition: "alcohol abuse"
- Condition: "soy-bean oil allergy"